Cuál de las siguientes enzimas está fuertemente asociada con la membrana mitocondrial interna:
1. Citrato sintasa.
2. Succinato deshidrogenasa.
3. Fumarasa.
4. α-cetoglutarato deshidrogenasa.

Respuesta correcta: 2. Succinato deshidrogenasa.